根據AJCC TNM（第 6 版）的分期系統，大腸直腸癌須有幾個以上的局部淋巴結轉移才算是N2？
A. 3 個
B. 4 個
C. 5 個
D. 10 個

正確答案：B. 4 個